一位 3 歲男孩，就醫時發現右臉及右手腳每隔 1 秒鐘就有一次抽動的現象，神智仍保持清醒，但神經學檢查發現右手腳已呈癱瘓，這種情形已經持續 1 個月以上。下列敘述何者錯誤？
A. 最可能的診斷是 Rasmussen encephalitis
B. 局部性發作重積狀態（epilepsia partialis continua）為其特徵性之臨床表現
C. 大腦核磁共振造影檢查（MRI）呈現左大腦半球萎縮現象
D. 病理切片特徵為無數大小不一的空洞，即為海綿狀腦病變（spongiform encephalopathy）

正確答案：D. 病理切片特徵為無數大小不一的空洞，即為海綿狀腦病變（spongiform encephalopathy）